Absent irreversible pulpal alteration;

The above is a clinical trial inclusion criterion. Annotated with entity spans:
[Negation: Absent] [Condition: irreversible pulpal alteration];